Clinical trial exclusion criterion:
1. Expected performance of PCI < 60 minutes from diagnosis (qualifying ECG) or inability to arrive at the catheterisation laboratory within 3 hours

Annotated entities:
- Device: "PCI"
- Temporal: "< 60 minutes from diagnosis"
- Reference_point: "diagnosis"
- Non-query-able: "inability to arrive at the catheterisation laboratory within 3 hours"